Clinical trial exclusion criterion:
inability to correct coagulopathy;

Annotated entities:
- Condition: "coagulopathy"
- Procedure: "correct"
- Mood: "inability to"